¿Cuál de los siguientes síntomas asociados con la hipertensión arterial tiene peor pronóstico?
1. Pérdida brusca de fuerza de pierna y brazo derechos de 10 minutos de duración.
2. Epistaxis de 30 minutos de duración.
3. Cefalea nucal vespertina.
4. Taquicardia y temblor.

Respuesta correcta: 1. Pérdida brusca de fuerza de pierna y brazo derechos de 10 minutos de duración.